用於免疫抑制作用的類固醇（corticosteroid）有下列各項作用，何者除外？
A. 降低IL-1, TNF α, IL-4, IL-5等之生成
B. 降低prostaglandins, leukotrienes等之生成
C. 降低黏	分子（adhesion molecules）等之生成
D. 降低內核酸酵素（endonucleases）等之生成

正確答案：D. 降低內核酸酵素（endonucleases）等之生成